El ARN nucleolar pequeño (ARNsno) está implicado en:
1. El procesamiento del ARNr.
2. La inhibición de la traducción del ARNm.
3. La degradación de otras moléculas de ARN.
4. El procesamiento de los pre-ARNm.

Respuesta correcta: 1. El procesamiento del ARNr.